Elective open abdominal hysterectomy with midline incision, age > 18 years, American Society of Anesthesiologist classification score (ASA classification) 1-3.

The above is a clinical trial inclusion criterion. Annotated with entity spans:
[Qualifier: Elective] [Procedure: open abdominal hysterectomy] with [Qualifier: midline incision], [Person: age] [Value: > 18 years], [Measurement: American Society of Anesthesiologist classification score] ([Measurement: ASA classification]) [Value: 1-3].